Clinical trial exclusion criterion:
Significant communicative impairments

Annotated entities:
- Qualifier: "Significant"
- Undefined_semantics: "Significant"
- Condition: "communicative impairments"
- Undefined_semantics: "communicative impairments"